Active upper GI bleeding within 3 months (90 days) prior to procedure.

The above is a clinical trial exclusion criterion. Annotated with entity spans:
[Temporal: Active] [Condition: upper GI bleeding] [Temporal: within 3 months (90 days) prior to procedure].